Chronic treatment with strong CYP3A4 inhibitor/ inducer, acid reducing agent, Proton pump inhibitors

The above is a clinical trial exclusion criterion. Annotated with entity spans:
Chronic treatment with [Drug: strong CYP3A4 inhibitor]/ inducer, [Drug: acid reducing agent], [Drug: Proton pump inhibitors]